有關胃癌的敘述，下列何者錯誤？
A. 瀰散型（diffuse type）常見 CDH1 基因突變
B. 瀰散型（diffuse type）較腸型（intestinal type）更常見於高發生率的國家
C. 近年來胃癌發生率的下降，主要是腸型（intestinal type）的減少
D. 家族性胃癌大多是瀰散型（diffuse type）

正確答案：B. 瀰散型（diffuse type）較腸型（intestinal type）更常見於高發生率的國家